Previous sub-urethral sling

The above is a clinical trial exclusion criterion. Annotated with entity spans:
[Temporal: Previous] [Procedure: sub-urethral sling]